El agua regia disuelve al oro porque de sus dos componentes:
1. El ácido sulfúrico actúa como oxidante y el ácido clorhídrico forma un complejo clorurado soluble de Au3+.
2. El ácido clorhídrico aumenta el poder oxidante del ácido nítrico.
3. El ácido nítrico actúa como oxidante y el ácido clorhídrico forma un complejo clorurado soluble de Au3+.
4. El ácido clorhídrico actúa como oxidante y el ácido nítrico forma un complejo soluble de Au3+.
5. El ácido nítrico actúa como oxidante y el ácido clorhídrico forma un complejo clorurado soluble de Au2+.

Respuesta correcta: 3. El ácido nítrico actúa como oxidante y el ácido clorhídrico forma un complejo clorurado soluble de Au3+.